Subject with a known hypersensitivity to any component of the investigational medications, monoamine oxidase inhibitors, phosphodiesterase type 5 inhibitors or phenylethylamines

The above is a clinical trial exclusion criterion. Annotated with entity spans:
Subject with a known [Condition: hypersensitivity] to any component of the [Qualifier: investigational] [Drug: medications], [Drug: monoamine oxidase inhibitors], [Drug: phosphodiesterase type 5 inhibitors] or [Drug: phenylethylamines]